Clinical trial exclusion criterion:
Contraindication to vaginal delivery

Annotated entities:
- Condition: "Contraindication"
- Procedure: "vaginal delivery"